Presence of another pathology that could influence exercise tolerance

The above is a clinical trial exclusion criterion. Annotated with entity spans:
Presence of [Qualifier: another] [Condition: pathology] that could [Qualifier: influence exercise tolerance]